Clinical trial exclusion criterion:
Current pregnancy;

Annotated entities:
- Temporal: "Current"
- Condition: "pregnancy"